Clinical trial inclusion criterion:
Pregnant women admitted to Women health hospital with a diagnosis of severe pre-eclampsia

Annotated entities:
- Condition: "Pregnant"
- Person: "women"
- Procedure: "admitted to"
- Visit: "Women health hospital"
- Qualifier: "severe"
- Condition: "pre-eclampsia"